某病患主訴最近常覺得口渴，身體檢查時發現其呼吸有acetone的果香味、空腹血糖值高達380 mg/dL。相對於正常人，該病患尿液不會有下列何者變化？
A. 尿液的pH值較正常人低
B. 尿液之NH4+排出量較正常人多
C. 24小時之尿液排出量較正常人多
D. 尿液之HCO3- 排出量較正常人多

正確答案：D. 尿液之HCO3- 排出量較正常人多